Clinical trial exclusion criterion:
Patients with preexisting neuromuscular conditions (myasthenia gravis, Eaton Lambert syndrome)

Entity relations:
- Subsumes("neuromuscular conditions", "myasthenia gravis")
- OR("myasthenia gravis", "Eaton Lambert syndrome")